Pregnant or breastfeeding.

The above is a clinical trial exclusion criterion. Annotated with entity spans:
[Condition: Pregnant] or [Observation: breastfeeding].